Fasting plasma glucose < 7,0 mM, HbA1c < 48 mmol/mol 3 months after RYGB

The above is a clinical trial inclusion criterion. Annotated with entity spans:
[Measurement: Fasting plasma glucose] [Value: < 7,0 mM], [Measurement: HbA1c] [Value: < 48 mmol/mol] [Temporal: 3 months after RYGB]